Secondary Sjögren's syndrome;

The above is a clinical trial exclusion criterion. Annotated with entity spans:
[Qualifier: Secondary] [Condition: Sjögren's syndrome];